手指頭的腱鞘炎（tenosynovitis），常是因穿刺性外傷所造成，不包括何種症狀？
A. 梭狀（fusiform）手指頭腫脹
B. 手指頭呈半彎曲姿勢
C. 手指頭被動伸直時不致疼痛
D. 整個曲肌腱鞘都會疼痛

正確答案：C. 手指頭被動伸直時不致疼痛